Surgical candidate per pancreatobiliary surgeon after multi-disciplinary discussion

The above is a clinical trial inclusion criterion. Annotated with entity spans:
[Condition: Surgical candidate] [Qualifier: per pancreatobiliary surgeon] after multi-disciplinary discussion